Subjects who are currently treated with sildenafil for PAH or taking sildenafil or tadalafil.

The above is a clinical trial exclusion criterion. Annotated with entity spans:
Subjects who are [Temporal: currently] treated with [Drug: sildenafil] for [Condition: PAH] or taking [Drug: sildenafil] or [Drug: tadalafil].